16. Subject has normal or insignificant coronaries (i.e. coronary lesion(s) less than 50% stenosis).

The above is a clinical trial exclusion criterion. Annotated with entity spans:
16. Subject has normal or insignificant coronaries (i.e. [Condition: coronary lesion](s) [Value: less than 50% stenosis]).